心絞痛病人使用硝酸鹽（Nitrate）、交感神經乙型阻斷劑（Beta blocker）和鈣離子阻斷劑後，若仍有心絞痛，下列何種處置不適當？
A. 打開鉀離子通道藥物（Potassium channel opener）
B. 非類固醇類抑制發炎藥物（Nonsteroidal anti-inflammatory drugs）
C. 心導管介入性診療
D. 使用血管張力素轉換抑制劑（Angiotensin-converting enzyme inhibitors）於有糖尿病合併症病人

正確答案：B. 非類固醇類抑制發炎藥物（Nonsteroidal anti-inflammatory drugs）